Clinical trial exclusion criterion:
renal impairment - CrCl =60 mL/minute

Entity relations:
- AND("renal impairment", "CrCl")
- Has_value("CrCl", "=60 mL/minute")